What is the target of daratumumab?

Daratumumab is a fully human anti-CD38 IgG1-κ monoclonal antibody. It is approved for treatment of multiple myeloma.